9. Understanding of study procedures

The above is a clinical trial inclusion criterion. Annotated with entity spans:
9. [Non-query-able: Understanding of study procedures]